Clinical trial inclusion criterion:
With Child score B or C

Annotated entities:
- Measurement: "Child score"
- Value: "B"
- Value: "C"